Patient on hemodialysis treatment for at least 1 month

The above is a clinical trial inclusion criterion. Annotated with entity spans:
Patient on [Procedure: hemodialysis] treatment for [Temporal: at least 1 month]